Soft or hard contact lenses use during the last month from inclusion day

The above is a clinical trial exclusion criterion. Annotated with entity spans:
[Device: Soft] or [Device: hard contact lenses] use [Temporal: during the last month from inclusion day]